心臟復健中，躺平休息時所消耗的能量為 1 MET，一位體重 70 公斤的成年人此時每分鐘的耗氧量為何？
A. 70 mL
B. 210 mL
C. 245 mL
D. 280 mL

正確答案：C. 245 mL